Clinical trial exclusion criterion:
Known allergy to skin patch

Annotated entities:
- Condition: "allergy"
- Device: "skin patch"